同時使用兩種篩檢工具來篩檢疾病（例如：使用乳房 X 光攝影檢查和乳房超音波來篩檢乳癌），只要任一個呈陽性反應，則需要進一步安排檢查，稱為平行檢定（tests in parallel），其目的是為增加：
A. 敏感度（sensitivity）
B. 特異度（specificity）
C. 發生率（incidence）
D. 盛行率（prevalence）

正確答案：A. 敏感度（sensitivity）